Clinical trial exclusion criterion:
9. Any Grade 2, 3 or 4 baseline haematology, chemistry or urinalysis laboratory abnormality according to the DAIDS Table for Grading Adverse Experiences

Entity relations:
- Has_temporal("DAIDS Table for Grading Adverse Experiences", "baseline")
- Has_value("DAIDS Table for Grading Adverse Experiences", "Grade 2, 3 or 4")
- multi("haematology abnormality", "haematology")
- multi("chemistry abnormality", "chemistry")
- multi("urinalysis abnormality", "urinalysis")
- multi("laboratory abnormality", "laboratory")
- OR("haematology abnormality", "chemistry abnormality", "urinalysis abnormality")